International Classification for Surgery of the Hand in Tetraplegia of 0-5 at 6 months

The above is a clinical trial inclusion criterion. Annotated with entity spans:
[Measurement: International Classification for Surgery of the Hand in Tetraplegia] of [Value: 0-5] [Temporal: at 6 months]